Clinical trial exclusion criterion:
Acute or chronic disease, as diabetes, heart disease, systemic arterial hypertension;

Entity relations:
- Subsumes("Acute disease", "diabetes")
- OR("diabetes", "systemic arterial hypertension", "heart disease")
- OR("Acute disease", "chronic disease")